停經後，婦女體內何種荷爾蒙不再合成及分泌？
A. 雌激素（estrogen）
B. 雄性素（androgen）
C. 黃體素（progesterone）
D. 黃體化激素（LH）

正確答案：C. 黃體素（progesterone）